Clinical trial exclusion criterion:
A significant risk of suicide corroborated by a score of =5 on item 10(suicidal thoughts) on the MADRS scale or by clinical judgment of the investigator

Entity relations:
- Has_qualifier("risk of suicide", "significant")
- Has_value("MADRS scale", "score of =5 on item 10")
- AND("risk of suicide", "MADRS scale")